Clinical trial exclusion criterion:
Patients who are recipients of multiple solid organ or islet cell tissue transplants, or have previously received an organ or tissue transplant. Patients who have a combined liver-kidney transplant.

Annotated entities:
- Multiplier: "multiple"
- Procedure: "solid organ transplants"
- Procedure: "islet cell tissue transplants"
- Temporal: "previously"
- Procedure: "organ transplant"
- Procedure: "tissue transplant"
- Procedure: "combined liver-kidney transplant"